Allergy to gonadotrophins

The above is a clinical trial exclusion criterion. Annotated with entity spans:
[Condition: Allergy] to [Drug: gonadotrophins]